Clinical trial exclusion criterion:
Exclusion Criteria: coronary artery disease, diabetes mellitus, contraindications to cardiac magnetic resonance imaging (CMR), weight >350 lbs, inability to lie flat for imaging, anemia, contraindications to regadenoson or aminophylline

Entity relations:
- AND("contraindications", "cardiac magnetic resonance imaging (CMR)")
- Has_value("weight", ">350 lbs")
- AND("contraindications", "regadenoson")
- OR("regadenoson", "aminophylline")
- OR("coronary artery disease", "diabetes mellitus", "contraindications", "weight", "inability to lie flat for imaging", "anemia", "contraindications")